El volumen de aire que queda en los pulmones tras realizar una espiración máxima se conoce como:
1. Volumen de reserva espiratoria.
2. Volumen residual.
3. Espacio muerto.
4. Capacidad residual funcional.

Respuesta correcta: 2. Volumen residual.